Patients concurrently treated with oral 5-aminosalicylates or corticosteroids were to receive a stable dose for at least 2 weeks before baseline, and patients receiving AZA and/or 6MP were to receive a stable dose for at least 4 weeks before baseline. Patients were required to maintain stable doses of their concomitant UC medications during the study.

The above is a clinical trial inclusion criterion. Annotated with entity spans:
Patients concurrently [Procedure: treated] with [Drug: oral 5-aminosalicylates] or [Drug: corticosteroids] were to receive a [Qualifier: stable dose] [Temporal: for at least 2 weeks before baseline], and patients receiving [Drug: AZA] and/or [Drug: 6MP] were to receive a [Qualifier: stable dose] [Temporal: for at least 4 weeks before baseline]. [Non-representable: Patients were required to maintain stable doses of their concomitant UC medications during the study.]